No contraindications to general and regional anesthesia

The above is a clinical trial inclusion criterion. Annotated with entity spans:
[Negation: No] [Condition: contraindications] to [Procedure: general] and [Procedure: regional anesthesia]